有關傳染性蛋白質（Prion）的敘述，下列何者正確？
A. 具有抗原性
B. 可被福馬林及紫外線去除活性
C. 無法有效刺激宿主產生干擾素（interferon）
D. 會造成肺泡細胞堅實化病變

正確答案：C. 無法有效刺激宿主產生干擾素（interferon）